Clinical trial exclusion criterion:
do not speak English

Annotated entities:
- Negation: "not"
- Observation: "speak English"